Clinical trial exclusion criterion:
7. A serious underlying medical condition that would impair the ability of the patient to receive protocol treatment.

Entity relations:
- Has_qualifier("medical condition", "serious")
- Has_mood("impair the ability of the patient to receive protocol treatment", "would")
- AND("medical condition", "impair the ability of the patient to receive protocol treatment")